Having an education degree of high school or above

The above is a clinical trial inclusion criterion. Annotated with entity spans:
Having an education [Person: degree of high school] or above